一個群體，如有一半成員具有免疫力，另一半則無，若發生流行時，如果每名受感染者會傳染給兩個人，而且不會有重覆感染出現，則流行趨勢為：
A. 1－1－1－1⋯⋯
B. 1－2－4－8⋯⋯
C. 1－4－16－64⋯⋯
D. 1－8－64－512⋯⋯

正確答案：A. 1－1－1－1⋯⋯